Clinical trial exclusion criterion:
Uncontrolled heart failure or NYHA function class III or IV

Entity relations:
- Has_value("NYHA function class", "III")
- Has_qualifier("heart failure", "Uncontrolled")
- AND("heart failure", "NYHA function class")
- OR("III", "IV")